Clinical trial exclusion criterion:
Known to be severely alpha-1-antitrypsin deficient (PI SZ or ZZ)

Annotated entities:
- Condition: "alpha-1-antitrypsin deficient"
- Qualifier: "severely"